Clinical trial inclusion criterion:
Follicles > 16 mm at the triggering day between 5-14

Annotated entities:
- Measurement: "Follicles > 16 mm"
- Value: "between 5-14"
- Temporal: "at the triggering day"